有關免疫抑制藥物的機轉，何者為誤？
A. Etanercept 主要的作用是抑制介白質-1（IL-1）所引起的發炎
B. 用在全身性紅斑狼瘡的 Hydroxychloroquine 原來是用來治療瘧疾
C. 靜脈注射的免疫球蛋白除了對川崎氏症有效外，也可以用來治療皮肌炎
D. Sulfasalazine 主要是用來治療幼年型類風濕關節炎

正確答案：A. Etanercept 主要的作用是抑制介白質-1（IL-1）所引起的發炎